Clinical trial inclusion criterion:
Fasting blood glucose > 126 mg/dl

Entity relations:
- Has_value("Fasting blood glucose", "> 126 mg/dl")